Clinical trial inclusion criterion:
Evaluable Disease in the Phase I, and measurable disease in the Phase II

Entity relations:
- Has_qualifier("in the Phase I", "Evaluable")
- Has_qualifier("in the Phase II", "measurable")
- Has_qualifier("Disease", "measurable")
- OR("Evaluable", "measurable")